¿Cómo explica el modelo concertado la cooperatividad de la hemoglobina?:
1. Los tetrámeros de la hemoglobina están exclusivamente en un estado R.
2. La unión de un ligando a un centro de ensamblaje aumenta la afinidad de unión a centros vecinos, sin que el estado T se convierta en R.
3. El equilibrio se desplaza desde el estado R al estado T.
4. La unión de ligandos desplaza el equilibrio entre dos estados, T y R.

Respuesta correcta: 4. La unión de ligandos desplaza el equilibrio entre dos estados, T y R.